下列何者與急性頭部外傷（traumatic brain injury）之預後無關？
A. 年齡（age）
B. 昏迷的時間長短（duration of coma）
C. 記憶缺失的時間長短（duration of posttraumatic amnesia）
D. 身體質量指數（body mass index, BMI）

正確答案：D. 身體質量指數（body mass index, BMI）